Durante la replicación del DNA:
1. Las dos hebras se sintetizan de forma continua.
2. Intervienen ribozimas.
3. Se oxidan los desoxirribonucleótidos trifosfato.
4. Interviene una primasa.
5. Las dos hebras permanecen unidas por puentes de hidrógeno.

Respuesta correcta: 4. Interviene una primasa.